Unlikely to survive 90 days

The above is a clinical trial exclusion criterion. Annotated with entity spans:
[Non-representable: Unlikely to survive 90 days]